Clinical trial inclusion criterion:
Eastern Cooperative Oncology Group (ECOG) 0 or 1

Annotated entities:
- Measurement: "Eastern Cooperative Oncology Group (ECOG)"
- Value: "0 or 1"